Clinical trial exclusion criterion:
Concomitant interstitial lung disease, sarcoidosis, other significant lung disease.

Annotated entities:
- Condition: "interstitial lung disease"
- Condition: "sarcoidosis"
- Condition: "lung disease"
- Temporal: "Concomitant"